Clinical trial exclusion criterion:
Hypersensitivity to Heparin or its derivatives.

Annotated entities:
- Condition: "Hypersensitivity"
- Drug: "Heparin"